Un paciente intervenido quirúrgicamente de fractura de fémur desarrolla un embolismo pulmonar postoperatorio. Se inicia un tratamiento con heparina no fraccionada. Al cabo de 7 días las plaquetas (previamente normales) disminuyen hasta 45.000. ¿Cuál es el cuadro más probable de esta trombocitopenia?
1. Inducción de anticuerpos antiplaquetarios.
2. Esplenomegalia por secuestro plaquetar.
3. Supresión medular inducida por heparina actuando sobre los megacariocitos.
4. Formación de anticuerpos contra el complejo heparina-factor 4 plaquetario.

Respuesta correcta: 4. Formación de anticuerpos contra el complejo heparina-factor 4 plaquetario.